有關闌尾類癌（appendiceal carcinoid tumor）之敘述，下列何者錯誤？
A. 是闌尾最常見的惡性腫瘤
B. 大部分是無症狀的，而且小於 1 公分
C. 若是 1.8 公分大小，位於基底部（base of appendix），單純施行闌尾切除術即可
D. 若是 3 公分大小，最好施行右半結腸切除術（right hemicolectomy）

正確答案：C. 若是 1.8 公分大小，位於基底部（base of appendix），單純施行闌尾切除術即可